Clinical trial exclusion criterion:
Uncontrolled diabetes

Annotated entities:
- Qualifier: "Uncontrolled"
- Condition: "diabetes"